Uncontrolled hypertension, defined as sustained blood pressure = 180/110 mm Hg (systolic BP = 180 mm Hg and/or diastolic BP = 110 mm Hg) prior to randomisation

The above is a clinical trial exclusion criterion. Annotated with entity spans:
[Qualifier: Uncontrolled] [Condition: hypertension], defined as sustained [Measurement: blood pressure] [Value: = 180/110 mm Hg] ([Measurement: systolic BP] [Value: = 180 mm Hg] and/or [Measurement: diastolic BP] [Value: = 110 mm Hg]) prior to randomisation